Clinical trial exclusion criterion:
9. Women currently using narcotics

Annotated entities:
- Parsing_Error: "9."
- Person: "Women"
- Drug: "narcotics"